Clinical trial exclusion criterion:
Pregnant (as evidenced by positive pregnancy test) or nursing women

Annotated entities:
- Condition: "Pregnant"
- Measurement: "pregnancy test"
- Value: "positive"
- Observation: "nursing"
- Person: "women"